Clinical trial exclusion criterion:
concomitant biofeedback

Entity relations:
- Has_temporal("biofeedback", "concomitant")